No febrile illnesses with temperature >39 degree celsius for more than five consecutive days within the week preceding the Screening Visit.

The above is a clinical trial exclusion criterion. Annotated with entity spans:
[Negation: No] [Condition: febrile illnesses] with [Measurement: temperature] [Value: >39 degree celsius] [Temporal: for more than five consecutive days] [Temporal: within the week preceding the Screening Visit].